Currently taking anticoagulants, other than aspirin, unless the patient can be taken off the anticoagulant for surgery.

The above is a clinical trial exclusion criterion. Annotated with entity spans:
Currently taking [Drug: anticoagulants], [Negation: other than] [Drug: aspirin], [Non-representable: unless the patient can be taken off the anticoagulant for surgery].